¿A qué se denomina “Coste oculto” de la recompensa?
1. A que no se conoce el valor real que tiene la recompensa o refuerzo.
2. A la reducción de la conducta motivada intrínsecamente, que puede darse si se proporciona una recompensa externa.
3. Al hecho de que la conducta motivada intrínsecamente no precisa de recompensa externa para llevarse a cabo.
4. A no fijar de antemano el valor de la recompensa por realizar una tarea.
5. A un castigo asociado intrínsecamente a una recompensa.

Respuesta correcta: 2. A la reducción de la conducta motivada intrínsecamente, que puede darse si se proporciona una recompensa externa.